9. Chronic infection related to tuberculosis or fungal or mycobacterial disease.

The above is a clinical trial exclusion criterion. Annotated with entity spans:
[Parsing_Error: 9.] [Multiplier: Chronic] [Condition: infection] [Observation: related to] [Condition: tuberculosis] or [Condition: fungal] or [Condition: mycobacterial disease].